Clinical trial inclusion criterion:
Any comparable successor IPG (MRI conditional system, BSCI) compatible with

Entity relations:
- Has_qualifier("successor IPG", "comparable")
- Subsumes("successor IPG", "MRI conditional system")
- OR("MRI conditional system", "BSCI")